Clinical trial exclusion criterion:
Have a contraindication to NRT with no medical clearance from the primary care provider or study physician

Entity relations:
- AND("contraindication", "NRT")